Clinical trial inclusion criterion:
No prior antibiotic treatment

Annotated entities:
- Negation: "No"
- Temporal: "prior"
- Procedure: "antibiotic treatment"